Para decidir postponer el alta a un niño en la maternidad a las 48 horas del parto se tendrá en cuenta los siguientes criterios EXCEPTO uno, indíquelo.
1. Ictericia evidente en el primer día de vida.
2. VDRL positivo.
3. Pérdida de peso del 7%.
4. Lactancia materna no establecida.
5. Falta de evacuación de meconio.

Respuesta correcta: 3. Pérdida de peso del 7%.